目前所知，阿茲海默症（Alzheimer disease）成因的危險因子與下列何者最為相關？
A. 年齡老化（aging）
B. 心血管危險因子，如高血壓（hypertension）
C. 低教育程度（low education）
D. 頭部外傷（head injury）

正確答案：A. 年齡老化（aging）